Clinical trial inclusion criterion:
Adolescent (10-21 years) undergoing spinal fusion for idiopathic scoliosis, spondylolisthesis or Scheuermann kyphosis.

Entity relations:
- Has_value("years", "10-21 years")
- Subsumes("Adolescent", "years")
- AND("spinal fusion", "idiopathic scoliosis")
- OR("idiopathic scoliosis", "spondylolisthesis", "Scheuermann kyphosis")